The patients are non-pregnant, and disposed to practice contraception during the whole trial.

The above is a clinical trial inclusion criterion. Annotated with entity spans:
[Pregnancy_considerations: The patients are non-pregnant, and disposed to practice contraception during the whole trial.]